Clinical trial exclusion criterion:
conditions that may lead to complicated infections (i.e. renal diseases, patients with urinary catheter)

Entity relations:
- AND("patients", "urinary catheter")
- Subsumes("conditions", "renal diseases")
- AND("conditions", "complicated infections")
- OR("renal diseases", "patients")